Clinical trial inclusion criterion:
18-80 year, male or female.

Entity relations:
- Has_value("year", "18-80")
- OR("male", "female")